What is STATegra?

STATegra is a comprehensive multi-omics dataset of B-cell differentiation in mouse. It includes measurements from up to 10 different omics technologies applied to the same biological system, namely the well-studied mouse pre-B-cell differentiation.